Clinical trial exclusion criterion:
Subject is unable to perform tasks associated with study

Annotated entities:
- Post-eligibility: "Subject is unable to perform tasks associated with study"